life expectancy of more than 3 months

The above is a clinical trial inclusion criterion. Annotated with entity spans:
[Observation: life expectancy] of [Temporal: more than 3 months]